Clinical trial inclusion criterion:
Prostate volume = 100 cc

Entity relations:
- Has_value("Prostate volume", "= 100 cc")